Clinical trial exclusion criteria:
Human immunodeficiency virus (HIV)-infected
Baseline serology showed a nonreactive RPR test
follow-up is inadequate
Allergic to penicillin
Pregnant woman

Annotated entities:
- Condition: "Human immunodeficiency virus (HIV)-infected"
- Temporal: "Baseline"
- Procedure: "serology"
- Value: "nonreactive"
- Measurement: "RPR test"
- Observation: "follow-up is inadequate"
- Condition: "Allergic"
- Drug: "penicillin"
- Condition: "Pregnant"
- Person: "woman"